Clinical trial inclusion criterion:
Pinhole visual acuity worse than 20/70 in the affected eye

Annotated entities:
- Measurement: "Pinhole visual acuity"
- Value: "worse than 20/70"